Montreal classification: no limitation, except age> 6.

The above is a clinical trial inclusion criterion. Annotated with entity spans:
[Non-representable: Montreal classification: no limitation, except age> 6.]